關於口服排卵藥物 clomiphene citrate，下列敘述何者最正確？
A. 需使用於 hypothalamus-pituitary axis 功能失調的女性
B. 具強效的雌激素作用
C. 會減少 GnRH 分泌
D. 會使子宮內膜變薄

正確答案：D. 會使子宮內膜變薄